Clinical trial exclusion criterion:
Any history of brain metastases or any other active central nervous system (CNS) disease

Annotated entities:
- Condition: "brain metastases"
- Temporal: "history of"
- Condition: "any other central nervous system (CNS) disease"
- Temporal: "active"